關於人格違常（personality disorder），下列敘述何者正確？
A. 邊緣性人格違常（borderline personality disorder）男性個案是女性個案的兩倍
B. 反社會人格違常（antisocial personality disorder）相較一般大眾並沒有較高比率的酒精或物質濫用
C. 強迫性人格違常（obsessive-compulsive personality disorder）的核心症狀是完美主義並且缺乏彈性，但他們仍保有良好的社交技巧，交友並不受影響
D. 人格違常常共病其他精神疾病，如物質濫用，憂鬱症，焦慮症等

正確答案：D. 人格違常常共病其他精神疾病，如物質濫用，憂鬱症，焦慮症等